List Parkin binding partners

HSP90
CDC37
GRP75
HSP60
LRPPRC
TUFM
PICK1
PSMA7
Pael receptor